Clinical trial inclusion criterion:
diagnosed as type 2 diabetes according to the criteria of the World Health Organization in 1999.

Entity relations:
- Has_qualifier("type 2 diabetes", "criteria of the World Health Organization in 1999")